Clinical trial exclusion criterion:
active herpes outbreak

Annotated entities:
- Condition: "herpes"
- Qualifier: "active"